Lack of informed consent signed,

The above is a clinical trial exclusion criterion. Annotated with entity spans:
[Negation: Lack of] [Observation: informed consent signed],